Clinical trial inclusion criterion:
1. PPROM with gestational age between 27 to 34 weeks

Annotated entities:
- Parsing_Error: "1."
- Measurement: "gestational age"
- Value: "between 27 to 34 weeks"
- Condition: "PPROM"